有關檢定兩個母群體平均值是否不同，統計推論可能會犯的錯誤型態及檢力（power），下列何者錯誤？
A. 增加樣本數可以增加 power
B. 虛無假說為真時，作出推翻虛無假說的決定就犯 Type I error
C. 對立假說為真時，作出推翻虛無假說的決定的機率就是 power
D. 兩個母群體的平均值愈接近，power 就愈大

正確答案：D. 兩個母群體的平均值愈接近，power 就愈大